一位 72 歲健康男性 2 天前於浴室滑倒，主訴右髖部疼痛無法行走，X 光顯示股骨頸骨折（femoral neck fracture）合併移位，下列處置中，何者最為適當？
A. 石膏固定
B. 立刻復位，右下肢皮膚牽引兩周
C. 立刻復位，右下肢骨骼牽引四周
D. 行人工半髖關節置換（hemiarthroplasty）

正確答案：D. 行人工半髖關節置換（hemiarthroplasty）